Agree to abide by the study protocol and its restrictions and be able to complete all aspects of the study, including all visits and tests

The above is a clinical trial inclusion criterion. Annotated with entity spans:
[Post-eligibility: Agree to abide by the study protocol and its restrictions and be able to complete all aspects of the study, including all visits and tests]